Clinical trial inclusion criterion:
No mediastinal or celiac, or suspected metastatic lymph nodes by EUS,

Entity relations:
- Has_negation("lymph nodes", "No")
- Has_qualifier("lymph nodes", "metastatic")
- AND("EUS", "lymph nodes")
- Has_qualifier("lymph nodes", "celiac")
- Has_qualifier("lymph nodes", "mediastinal")